Clinical trial inclusion criterion:
In sustained clinical remission for the last 6 months while receiving treatment with either etanercept, infliximab, or adalimumab, and greater than or equal to 1 DMARD (methotrexate, hydroxychloroquine, sulfasalazine, leflunomide, minocycline, cyclosporine, azathioprine, gold, penicillamine). DAS28 should be less than 2.6 on each visit over the preceding 6 months, with at least one visit 2-4 months before enrollment. If there is no visit 6 months before enrollment, the nearest visit in the 6-12 month period before enrollment should be considered and have a DAS28 less than 2.6.

Annotated entities:
- Condition: "sustained clinical remission"
- Multiplier: "for the last 6 months"
- Drug: "etanercept"
- Drug: "infliximab"
- Drug: "adalimumab"
- Multiplier: "greater than or equal to 1"
- Drug: "DMARD"
- Drug: "methotrexate"
- Drug: "hydroxychloroquine"
- Drug: "sulfasalazine"
- Drug: "leflunomide"
- Drug: "minocycline"
- Drug: "cyclosporine"
- Drug: "azathioprine"
- Drug: "gold"
- Drug: "penicillamine"
- Measurement: "DAS28"
- Value: "less than 2.6"
- Multiplier: "over the preceding 6 months"
- Multiplier: "at least one"
- Procedure: "visit"
- Procedure: "visit"
- Multiplier: "on each visit"
- Temporal: "2-4 months before enrollment"
- Non-representable: "If there is no visit 6 months before enrollment, the nearest visit in the 6-12 month period before enrollment should be considered and have a DAS28 less than 2.6."